What is the normal body temperature in dogs?

According to the American Kennel Club (AKC), a temperature of 101 to 102.5 degrees Fahrenheit (38.3 to 39.2 degrees Celsius) is typical for dogs